patients affected by mono-lateral symptomatic knee articular degenerative pathology with history of chronic (for at least 4 months) pain or swelling;

The above is a clinical trial inclusion criterion. Annotated with entity spans:
patients affected by [Qualifier: mono-lateral] [Qualifier: symptomatic] [Condition: knee articular degenerative pathology] with history of [Temporal: chronic] ([Temporal: for at least 4 months]) [Condition: pain] or [Condition: swelling];